Clinical trial exclusion criterion:
potassium > 6 mg/dl

Entity relations:
- Has_value("potassium", "> 6 mg/dl")